Clinical trial exclusion criterion:
Subject with hereditary degenerative retinal disorders such as retinitis pigmentosa

Annotated entities:
- Condition: "hereditary degenerative retinal disorders"
- Condition: "retinitis pigmentosa"